What are the key characteristics of the syndrome caused by ANKRD17 loss-of-function variants?

Heterozygous ANKRD17 loss-of-function variants cause a syndrome with intellectual disability, speech delay, and dysmorphism, as well as growth failure, feeding difficulties, non-specific MRI abnormalities, epilepsy, and/or abnormal EEG, and predisposition to recurrent infections.